Clinical trial exclusion criterion:
clinically significant bleeding within the 30 days prior to the scheduled procedure;

Entity relations:
- Has_temporal("bleeding", "within the 30 days prior to the scheduled procedure")
- Has_qualifier("bleeding", "clinically significant")
- Has_index("within the 30 days prior to the scheduled procedure", "the scheduled procedure")